En los coronaviurs, el ensamblaje de los viriones tiene lugar en el (la):
1. Retículo endoplásmico rugoso.
2. Matriz mitocondrial.
3. Núcleo.
4. Citosol.
5. Membrana citoplasmática.

Respuesta correcta: 1. Retículo endoplásmico rugoso.